Clinical trial inclusion criterion:
Have a body mass index (BMI) = 35 kg/m2.

Annotated entities:
- Measurement: "body mass index (BMI)"
- Value: "= 35 kg/m2"